Use of pain medication (except paracetamol) within 3 days

The above is a clinical trial exclusion criterion. Annotated with entity spans:
Use of [Drug: pain medication] ([Negation: except] [Drug: paracetamol]) [Temporal: within 3 days]